治療間日瘧（Plasmodium vivax）時，為避免復發（relapse），應合併使用下列何種藥物，以根除病 人肝內之隱眠小體（hypnozoites）？
A. Quinine
B. Primaquine
C. Proguanil
D. Mefloquine

正確答案：B. Primaquine